Clinical trial exclusion criterion:
Pregnant women or women with potential childbearing

Annotated entities:
- Condition: "Pregnant"
- Person: "women"
- Person: "women"
- Condition: "potential childbearing"